有關家族性高膽固醇血症（familial hypercholesterolemia）之敘述，下列何者正確？
A. 主要是低密度脂蛋白結構異常引起的遺傳性疾病
B. 大多是低密度脂蛋白基因印記（genomic imprinting）異常所致
C. 大多是調控低密度脂蛋白表現的基因被甲基化（methylation）所致
D. 大多是低密度脂蛋白受器（receptor）基因突變引起的遺傳性疾病

正確答案：D. 大多是低密度脂蛋白受器（receptor）基因突變引起的遺傳性疾病